Clinical trial inclusion criterion:
Subjective visual loss > 6 weeks, interpreted as onset of active disease;

Annotated entities:
- Condition: "Subjective visual loss"
- Temporal: "> 6 weeks"
- Non-representable: "interpreted as onset of active disease;"